Clinical trial exclusion criterion:
Poorly controlled hypertension (>170/>110)

Annotated entities:
- Condition: "hypertension"
- Qualifier: "Poorly controlled"